Clinical trial inclusion criterion:
American Spinal Injury Association Impairment Scale A or B

Entity relations:
- Has_value("American Spinal Injury Association Impairment Scale", "A or B")